Anticipated discontinuation of clopidogrel or ticagrelor within the 12 month follow up period, example for elective surgery

The above is a clinical trial inclusion criterion. Annotated with entity spans:
Anticipated discontinuation of [Drug: clopidogrel] or [Drug: ticagrelor] [Temporal: within the 12 month follow up period], [Mood: example for] [Procedure: elective surgery]